What molecule is targeted by suvorexant?

Suvorexant is a dual orexin receptor antagonist for the treatment of sleep onset and sleep maintenance insomnia.